Clinical trial exclusion criterion:
Participants with prostate specific antigen (PSA) > 3.0 ng/mL (or 1.5 if on 5-alpha reductase inhibitors)

Entity relations:
- Has_value("5-alpha reductase inhibitors", "1.5")
- Has_value("prostate specific antigen (PSA)", "> 3.0 ng/mL")
- OR("> 3.0 ng/mL", "5-alpha reductase inhibitors")